Clinical trial exclusion criterion:
history of gastric or duodenal ulcers

Entity relations:
- OR("gastric ulcers", "duodenal ulcers")